Clinical trial exclusion criterion:
Pregnant women as determined by Urine ß-HCG pregnancy test

Annotated entities:
- Pregnancy_considerations: "Pregnant women as determined by Urine ß-HCG pregnancy test"